Clinical trial exclusion criterion:
Current use of active topical medication in the planned investigational area for chronic atopic dermatitis within two weeks

Entity relations:
- Has_temporal("chronic atopic dermatitis", "within two weeks")
- Has_temporal("topical medication", "active")
- AND("topical medication", "chronic atopic dermatitis")